Indique la variante genética del HLA que expresa el 90 % de los pacientes celíacos:
1. DQ8.
2. DQ2.
3. B27.
4. B12.

Respuesta correcta: 2. DQ2.